Clinical trial exclusion criterion:
Contra-indication to use of GLM (Hypersensitivity to the active substance or to any of the excipients; Active tuberculosis (TB), acute or chronic Hepatitis B infection or other severe infections such as sepsis and/or opportunistic infections including HIV infection; Moderate or severe heart failure (NYHA class III/IV)

Entity relations:
- AND("Hypersensitivity", "active substance")
- Has_temporal("tuberculosis (TB)", "Active")
- Has_qualifier("Hepatitis B infection", "acute")
- Subsumes("opportunistic infections", "HIV infection")
- Subsumes("severe infections", "sepsis")
- Has_value("NYHA", "class III/IV")
- Subsumes("Moderate", "NYHA")
- Has_qualifier("heart failure", "Moderate")
- AND("Contra-indication", "GLM")
- Subsumes("Contra-indication", "Hypersensitivity")
- OR("active substance", "excipients")
- OR("acute", "chronic")
- OR("Hypersensitivity", "opportunistic infections", "Hepatitis B infection", "tuberculosis (TB)", "heart failure", "severe infections")
- OR("Moderate", "severe")